陳太太因右手拇指及食指、中指常常半夜麻醒，至門診求診，下列何種檢查最能提供確定診斷是「腕隧道症候群（carpal tunnel syndrome）」？
A. 電生理檢查（Electrophysiology Study, EPS）
B. 核磁共振造影術（MRI）
C. 電腦斷層掃描（CT）
D. 手部超音波檢查（Sonography）

正確答案：A. 電生理檢查（Electrophysiology Study, EPS）